病人做化療（chemotherapy）或手術後所引起的噁心、嘔吐症狀，可以預先使用下列何種藥物來緩解，其作用機轉是透過拮抗neurokinin（NK1）的受體？
A. riociguat
B. fasudil
C. bosentan
D. aprepitant

正確答案：D. aprepitant